Clinical trial exclusion criterion:
Psychiatric antecedent

Entity relations:
- Has_temporal("Psychiatric", "antecedent")